Participation in another clinical trial within 30 days of enrolment in our trial

The above is a clinical trial exclusion criterion. Annotated with entity spans:
[Competing_trial: Participation in another clinical trial within 30 days of enrolment in our trial]